Which type of cancer has been suggested as a strategy for potential small-molecule inhibition of METTL3?

Small-molecule inhibition of METTL3 is a strategy against myeloid leukaemia. Targeting of RNA-modifying enzymes represents a promising avenue for anticancer therapy.